El proceso de maduración para la célula dendrítica supone cambios importantes en su fisiología, tales como la:
1. Disminución de la expresión del marcador CCR7.
2. Reducción de su capacidad endocítica.
3. Disminución de la expresión de moléculas de histocompatibilidad.
4. Síntesis de IL-13.
5. Reducción de la expresión de CD40.

Respuesta correcta: 2. Reducción de su capacidad endocítica.